From where is gamabufotalin (GBT) isolated?

gamabufotalin (GBT) was isolated from toad venom.